經由有組織的社區力量，致力於增進並維護個人與整個社會群眾的心理健康，預防心理異常或精神疾病，減輕因疾病帶來對個人與社區不良影響。屬於下列何種定義？
A. 健康心理
B. 公共心理衛生
C. 健康促進
D. 精神衛生

正確答案：B. 公共心理衛生